一位42歲女性，主訴漸進性茶色尿、皮膚變黑且癢、無飲酒史、無長期中西藥服用史，身體診察顯示有黃 疸、無腹部壓痛。初步血液檢查顯示：WBC：3800/mm3、Hb：11.8 g/dL、血小板：98000/mm3、ALT
 （GPT）：48 U/L、AST（GOT）：62 U/L、bilirubin（total/direct）：5.8/3.9 mg/dL、鹼性磷酸酶（alkaline phosphatase）：586 U/L（正常值＜100 U/L）、HBsAg：陰性、anti-HCV：陰性。下列何者不是適宜之檢查：
A. 腹部超音波檢查
B. anti-mitochondrial antibody
C. serum ceruloplasmin
D. serum γ-GT

正確答案：C. serum ceruloplasmin